Willing to attempt to abstain from alcohol completely for the duration of the study

The above is a clinical trial inclusion criterion. Annotated with entity spans:
[Mood: Willing] to attempt to [Condition: abstain from alcohol] [Qualifier: completely] for the duration of the study